下列那種細菌在培養基上生長有遊走（swarming）的特徵，且與腎臟結石（renal stones）生成最有關？
A. 奇異變形桿菌（Proteus mirabilis）
B. 黏質沙雷氏菌（Serratia marcescens）
C. 產氣腸桿菌（Enterobacter aerogenes）
D. 肺炎克雷伯氏桿菌（Klebsiella pneumoniae）

正確答案：A. 奇異變形桿菌（Proteus mirabilis）